下列何項在腎前腎衰竭（Prerenal azotemia）最不常見？
A. 排鈉分率（FENa）小於 1%
B. 尿鈉大於 10 mmol/L
C. 尿比重大於 1.018
D. 出現玻璃圓柱（Hyaline casts）

正確答案：B. 尿鈉大於 10 mmol/L